Clinical trial exclusion criterion:
Women who are pregnant or breastfeeding (pregnancy defined as the state of a female after conception until the termination of gestation, confirmed by a positive human chorionic gonadotropin laboratory test (> 5mIU/mL)

Annotated entities:
- Condition: "pregnant"
- Observation: "breastfeeding"
- Person: "Women"
- Measurement: "human chorionic gonadotropin"
- Procedure: "human chorionic gonadotropin laboratory test"
- Value: "positive"
- Value: "> 5mIU/mL"